Clinical trial inclusion criterion:
The participant has received a levodopa combination drug for >= 1 month and has either of the following.

Annotated entities:
- Drug: "levodopa combination"
- Temporal: ">= 1 month"
- Parsing_Error: "has either of the following."